Spontaneously ovulating women

The above is a clinical trial inclusion criterion. Annotated with entity spans:
[Condition: Spontaneously ovulating] [Person: women]